Clinical trial exclusion criterion:
ischemic heart disease or any abnormality on treadmill stress test

Annotated entities:
- Condition: "ischemic heart disease"
- Measurement: "treadmill stress test"
- Value: "abnormality"